下列何者不是病患自控式止痛（patient-controlled analgesia）的好處？
A. 病患高滿意度
B. 避免注射引起之疼痛
C. 不需要因為年歲增加而調整藥物
D. 比較符合病患真正的需求

正確答案：C. 不需要因為年歲增加而調整藥物